因肥胖症而施行 laparoscopic gastric bypass 時，gastric pouch 要保留多少 mL？
A. 15~20
B. 25~30
C. 35~40
D. 45~50

正確答案：A. 15~20